6. Ability to read and write English

The above is a clinical trial inclusion criterion. Annotated with entity spans:
6. [Non-query-able: Ability to read and write English]